若頸動脈竇（carotid sinus）及主動脈弓（aortic arch）上的感壓受器（baroreceptor）放電頻率（firing  rate）增加，則下列何者正確？
A. 其訊號經由迷走（vagus）神經傳遞，中止於視丘（thalamus）
B. 其作用會興奮交感神經，使血管收縮（vasoconstriction）
C. 其作用會抑制副交感神經，降低心輸出量
D. 其作用會造成血管擴張（vasodilation）、心跳降低

正確答案：D. 其作用會造成血管擴張（vasodilation）、心跳降低